Clinical trial inclusion criterion:
Postural instability and gait disturbance phenotype

Annotated entities:
- Condition: "Postural instability"
- Condition: "gait disturbance"